• Diabetes duration >12 years

The above is a clinical trial exclusion criterion. Annotated with entity spans:
• [Condition: Diabetes] duration [Temporal: >12 years]